Clinical trial inclusion criterion:
Lack of participation in another clinical study,

Entity relations:
- Has_qualifier("participation in clinical study", "another")
- Has_negation("participation in clinical study", "Lack of")